下列有關百日咳毒素（pertussis toxin）的敘述，何者錯誤？
A. 是一種外毒素（exotoxin）
B. 藉著在細胞膜上打洞而毒殺宿主細胞
C. 會增加呼吸道黏液的分泌
D. 是組成百日咳疫苗的成分之一

正確答案：B. 藉著在細胞膜上打洞而毒殺宿主細胞